Clinical trial exclusion criteria:
patient refusal
age less than 40 or over 80 years
combined surgical procedures
emergency surgery
Left ventricular ejection fraction less than 50 per cent
calculated creatinine clearance less than 60 mL per minute

Annotated entities:
- Observation: "patient refusal"
- Person: "age"
- Value: "less than 40"
- Value: "over 80 years"
- Procedure: "combined surgical procedures"
- Procedure: "emergency surgery"
- Measurement: "Left ventricular ejection fraction"
- Value: "less than 50 per cent"
- Measurement: "calculated creatinine clearance"
- Value: "less than 60 mL per minute"